Life expectancy > 12 weeks.

The above is a clinical trial inclusion criterion. Annotated with entity spans:
[Observation: Life expectancy] > 12 weeks.